Clinical trial inclusion criterion:
Serum or plasma creatinine level less than or equal to 2 times the upper limit of normal

Annotated entities:
- Qualifier: "plasma"
- Qualifier: "Serum"
- Measurement: "creatinine level"
- Value: "less than or equal to 2 times the upper limit of normal"